Patients undergoing robotic-assisted laparoscopic prostatectomy

The above is a clinical trial inclusion criterion. Annotated with entity spans:
Patients undergoing r[Procedure: obotic-assisted laparoscopic prostatectomy]